GI intolerance of tuberculosis medications requiring discontinuation of tuberculosis medications.

The above is a clinical trial exclusion criterion. Annotated with entity spans:
[Condition: GI intolerance] of [Drug: tuberculosis medications] requiring [Procedure: discontinuation] of [Drug: tuberculosis medications].